History of prior treatment with disulfiram

The above is a clinical trial exclusion criterion. Annotated with entity spans:
[Temporal: History of prior treatment] with [Drug: disulfiram]